25歲女病人因呼吸困難及心悸就診。身體診察顯示血壓110/64 mmHg，脈搏116/min，兩側肺底可聽見濕性囉音。心臟聽診發現第一心音增加，心尖部位及胸骨左側下緣可聽見明顯的二尖瓣開瓣音（opening snap, OS）及心舒期隆隆雜音（diastolic rumbling murmur）。下列敘述何者正確？
A. 第一心音增加，表示二尖瓣狹窄不嚴重
B. 第二心音至開瓣音的間期（S2-OS interval）愈長表示二尖瓣狹窄愈嚴重
C. 心跳快為此類病人心臟的代償機轉，此時把心跳降低對病情不好，反而加重
D. diastolic rumbling murmur在此類病人發生心臟衰竭加重，心臟排血量低時，心雜音強度可能減弱甚至消失

正確答案：D. diastolic rumbling murmur在此類病人發生心臟衰竭加重，心臟排血量低時，心雜音強度可能減弱甚至消失